Clinical trial exclusion criterion:
History of decompensated cirrhosis (defined as jaundice in the presence of cirrhosis, ascites, bleeding gastric or esophageal varices or encephalopathy)

Entity relations:
- Has_qualifier("cirrhosis", "decompensated")
- Subsumes("cirrhosis", "jaundice")
- Subsumes("cirrhosis", "cirrhosis")
- Subsumes("cirrhosis", "ascites")
- Subsumes("cirrhosis", "bleeding gastric")
- OR("bleeding gastric", "esophageal varices", "encephalopathy")